IFG: 5.6mmol/L (100mg/dl)=FPG<7.0mmol/L (126mg/dl), or IGT: 7.8mmol/L (140mg/dl)=OGTT 2-h PG<11.1mmol/L (200mg/dl), or HbA1C 5.7-6.4% (39-47mmol/mol);

The above is a clinical trial inclusion criterion. Annotated with entity spans:
[Condition: IFG]: [Value: 5.6mmol/L] ([Value: 100mg/dl])=[Measurement: FPG][Value: <7.0mmol/L] ([Value: 126mg/dl]), or [Condition: IGT]: [Value: 7.8mmol/L] ([Value: 140mg/dl])=[Measurement: OGTT 2-h PG][Value: <11.1mmol/L] ([Value: 200mg/dl]), or [Measurement: HbA1C] [Value: 5.7-6.4%] ([Value: 39-47mmol/mol]);